Clinical trial inclusion criterion:
Type 2 Diabetes Mellitus patients

Annotated entities:
- Condition: "Type 2 Diabetes Mellitus"